Clinical trial exclusion criterion:
3. Clinically significant persistent immune-related adverse events following prior therapy.

Entity relations:
- Has_index("following prior therapy", "prior therapy")
- Has_temporal("immune-related adverse events", "following prior therapy")
- Has_qualifier("immune-related adverse events", "persistent")
- Has_qualifier("immune-related adverse events", "Clinically significant")